History of coronary artery disease (MI/heart attack, stroke, heart failure, or peripheral artery disease)

The above is a clinical trial inclusion criterion. Annotated with entity spans:
[Temporal: History] of [Condition: coronary artery disease] ([Condition: MI]/[Condition: heart attack], [Condition: stroke], [Condition: heart failure], or [Condition: peripheral artery disease])